1) Refusal of epidural catheter 2) Pregnancy 3) Bleeding History 4) Inability to understand how to use the PCA device 5) Medication interfering with blood coagulation 6) Patients allergic to local anesthetics 7) Patient refusal to participate in study 8) Developmental delay

The above is a clinical trial exclusion criterion. Annotated with entity spans:
[Line: 1) Refusal of epidural catheter] [Line: 2) Pregnancy] [Line: 3) Bleeding History] [Line: 4) Inability to understand how to use the PCA device] [Line: 5) Medication interfering with blood coagulation] [Line: 6) Patients allergic to local anesthetics] [Line: 7) Patient refusal to participate in study] [Line: 8) Developmental delay]